Clinical trial exclusion criterion:
(relative) Contraindications for FA or ICGA;

Entity relations:
- AND("Contraindications", "FA")
- OR("FA", "ICGA")